A nivel hormonal, el climaterio se caracteriza por:
1. Disminución de las gonadotropinas y aumento de los estrógenos.
2. Aumento de las gonadotropinas y disminución de los estrógenos.
3. Disminución de las gonadotropinas y de los estrógenos.
4. Aumento de las gonadotropinas y de los estrógenos.

Respuesta correcta: 2. Aumento de las gonadotropinas y disminución de los estrógenos.